Clinical trial inclusion criteria:
Infection with Plasmodium falciparum or P. vivax either alone or mixed
Age >12 months
Weight >5kg
Living in the study clusters

Annotated entities:
- Condition: "Infection"
- Qualifier: "Plasmodium falciparum"
- Qualifier: "P. vivax"
- Person: "Age"
- Value: ">12 months"
- Person: "Weight"
- Value: ">5kg"
- Non-query-able: "Living in the study clusters"